Clinical trial exclusion criterion:
Fertile males unwilling to use contraception

Annotated entities:
- Person: "males"
- Condition: "Fertile"
- Observation: "unwilling to use contraception"
- Non-query-able: "Fertile males unwilling to use contraception"
- Post-eligibility: "Fertile males unwilling to use contraception"